La replicación del DNA:
1. En eucariotas requiere fragmentos de Okazaki de más de 1000 nucleótidos de longitud.
2. Utiliza una actividad polimerasa 5´ 3´para sintetizar una hebra y una actividad polimerasa 3´ 5´para sintetizar la hebra complementaria.
3. Es semiconservativa.
4. Se inicia con el proceso de escisión.

Respuesta correcta: 3. Es semiconservativa.